Clinical trial inclusion criterion:
Meet criteria for schizophrenia, schizoaffective disorder, or another psychotic disorder based on structured clinical interview

Annotated entities:
- Condition: "schizophrenia"
- Condition: "schizoaffective disorder"
- Condition: "psychotic disorder"